關於真核生物DNA複製的敘述，下列何者錯誤？
A. 主要由DNA polymerase I進行DNA複製
B. 複製起始需要RNA引子（primer）
C. Helicase可解開雙股螺旋DNA
D. Replication protein A（ RPA）可與單股DNA結合

正確答案：A. 主要由DNA polymerase I進行DNA複製